Clinical trial inclusion criterion:
Basal follicle-stimulating hormone (FSH) <=12 International unit per liter (IU/L)

Annotated entities:
- Measurement: "Basal follicle-stimulating hormone (FSH)"
- Value: "<=12 International unit per liter (IU/L)"